在高速道路上突然減速的撞擊，很可能造成胸部傷害，尤其是外傷性主動脈斷裂，此種傷害，在胸部 X 光上最常見的表現是什麼？
A. 主動脈節不見（Obliteration of aortic knob）
B. 氣管偏向右邊（Deviation of the trachea to the right）
C. 左支氣管下移（Depression of the left main stem bronchus）
D. 中膈腔寬大（Widened mediastinum）

正確答案：D. 中膈腔寬大（Widened mediastinum）